pregnancy;

The above is a clinical trial exclusion criterion. Annotated with entity spans:
[Condition: pregnancy];